Single or twin pregnancies

The above is a clinical trial inclusion criterion. Annotated with entity spans:
[Value: Single] or [Value: twin] [Condition: pregnancies]